Clinical trial exclusion criteria:
contra-indication to inhalational induction (full stomach)
contra-indication to the use of rocuronium
American Society of Anesthesiologists score (ASA) III or IV
intracranial surgery
parental refusal
absence of affiliation to social security

Annotated entities:
- Condition: "contra-indication"
- Procedure: "inhalational induction"
- Qualifier: "full stomach"
- Condition: "contra-indication"
- Drug: "rocuronium"
- Measurement: "American Society of Anesthesiologists score (ASA)"
- Value: "III"
- Value: "IV"
- Procedure: "intracranial surgery"
- Informed_consent: "parental refusal"
- Observation: "affiliation to social security"
- Negation: "absence"